Any metal in or on the body (that cannot be removed) between the nose and the abdomen

The above is a clinical trial exclusion criterion. Annotated with entity spans:
Any [Device: metal in] or on the body (that cannot be removed) [Qualifier: between the nose and the abdomen]